下列何者被興奮後，可引發 Hering-Breuer reflex，藉以防止肺過度擴張？
A. 肺牽扯性受器（lung stretch receptors）
B. 肺刺激性受器（lung irritant receptors）
C. 主動脈體（aortic bodies）
D. 頸動脈體（carotid bodies）

正確答案：A. 肺牽扯性受器（lung stretch receptors）